fetal anomalies

The above is a clinical trial exclusion criterion. Annotated with entity spans:
[Condition: fetal anomalies]